Clinical trial inclusion criterion:
Have a normal ECG; must not have the following to be acceptable: pathologic Q wave abnormalities, significant ST-T wave changes, left ventricular hypertrophy, right bundle branch block, left bundle branch block. (sinus rhythm is between 55-100 beats per minute)

Entity relations:
- Has_value("ECG", "normal")
- Has_negation("pathologic Q wave abnormalities", "not")
- Has_negation("ST-T wave changes", "not")
- Has_negation("left ventricular hypertrophy", "not")
- Has_negation("right bundle branch block", "not")
- Has_negation("left bundle branch block", "not")